Indique la situación clínica que, en relación con la infección por virus de la hepatitis B, presenta un paciente de 5 años procedente de Nigeria, con exploración física normal y con la siguiente serología frente a hepatitis B: HBsAg + / ANTI-HBs – / HbeAg - / ANTI-HBe + / ANTI-HBc IgM -/ ANTI-HBc IgG + / DNA VHB +:
1. Infección aguda.
2. Infección crónica.
3. Paciente vacunado.
4. Portador asintomático.

Respuesta correcta: 2. Infección crónica.